Clinical trial inclusion criterion:
>= 18 years old the day of inclusion

Entity relations:
- Has_value("old", ">= 18 years")